Clinical trial exclusion criterion:
Patients taking B-blockers or Ca channel blockers.

Annotated entities:
- Drug: "Ca channel blockers"
- Drug: "B-blockers"